一位 50 歲男性，覺得明顯胸痛。心電圖檢查顯示急性心肌梗塞的變化。血液檢查發現血清 creatine kinase（CK）值有上升的現象。下列何種情況最能解釋血液的變化？
A. CK 合成增加
B. CK 分解速率減緩
C. 心肌細胞膜缺損
D. 心肌細胞核染色質凝集

正確答案：C. 心肌細胞膜缺損